No written lC by patient

The above is a clinical trial exclusion criterion. Annotated with entity spans:
[Informed_consent: No written lC by patient]